Clinical trial exclusion criterion:
Females who are pregnant, breast feeding, or planning a pregnancy during the course study.

Annotated entities:
- Pregnancy_considerations: "Females who are pregnant, breast feeding, or planning a pregnancy during the course study."